Clinical trial inclusion criterion:
18 years of age or older

Entity relations:
- Has_value("age", "18 years or older")